Clinical trial exclusion criterion:
Cerebral palsy

Annotated entities:
- Condition: "Cerebral palsy"